Current use of anticholinergics or other medications with anticholinergic activity

The above is a clinical trial exclusion criterion. Annotated with entity spans:
Current use of [Drug: anticholinergics] or other medications with anticholinergic activity